下肢深層靜脈栓塞（deep venous thrombosis）所導致的下肢水腫，其主要機轉為：
A. 靜水壓上升
B. 血漿滲透壓下降
C. 淋巴管阻塞
D. 鈉與水的滯留

正確答案：A. 靜水壓上升